Las bacterias que en mayor número de casos son responsables de la otitis media son:
1. Stretococcus pneumoniae, Haemophilus influenzae y klebsiella pneumoniae.
2. Streptococcus pneumoniae, pseudomonas fluerescens y moraxella catarrhalis.
3. Haemophilus influenzae, Klebsiella pneumoniae y Moraxella catarrhalis.
4. Streptococcus pneumoniae, Haemophilus influenzae y Moraxella catarrhalis.

Respuesta correcta: 4. Streptococcus pneumoniae, Haemophilus influenzae y Moraxella catarrhalis.